Clinical trial exclusion criterion:
HPN < 12 months

Entity relations:
- Has_value("HPN", "< 12 months")